Clinical trial inclusion criterion:
American society of anesthesiologist (ASA) physical status I or II

Entity relations:
- Subsumes("American society of anesthesiologist physical status", "ASA")
- Has_value("American society of anesthesiologist physical status", "I or II")